Clinical trial exclusion criterion:
A history of severe bleeding or bleeding disorders

Annotated entities:
- Temporal: "history"
- Qualifier: "severe"
- Condition: "bleeding"
- Condition: "bleeding disorders"